Clinical trial exclusion criterion:
Rifabutin, rifampin or rifapentine

Entity relations:
- OR("Rifabutin", "rifampin", "rifapentine")